Clinical trial inclusion criterion:
mNeff 0 acute diverticulitis (abdominal computed tomography scan)

Entity relations:
- Has_value("mNeff", "0")
- Has_qualifier("diverticulitis", "acute")